Clinical trial exclusion criterion:
Acute disease at the time of enrolment

Annotated entities:
- Condition: "Acute disease"
- Temporal: "at the time of enrolment"
- Reference_point: "enrolment"